Clinical trial inclusion criterion:
elective Laparoscopic myomectomy patients 24hr post-operative patient controlled analgesia analgesia no mild or severe liver or renal disfunction

Entity relations:
- Has_qualifier("myomectomy", "Laparoscopic")
- Has_qualifier("myomectomy", "elective")
- Has_qualifier("liver disfunction", "mild")
- Has_negation("liver disfunction", "no")
- OR("liver disfunction", "renal disfunction")
- OR("mild", "severe")